Not have informed consent for the present clinical trial, or do not fully understand the meaning of informed consent.

The above is a clinical trial exclusion criterion. Annotated with entity spans:
[Post-eligibility: Not have informed consent for the present clinical trial, or do not fully understand the meaning of informed consent].